Group I PAH, defined as a mPAP=25mmHg, PCWP<15mmHg and PVR[The PVR =(mPAP-PCWP)/CO]>3.0 Woods unit.

The above is a clinical trial inclusion criterion. Annotated with entity spans:
[Qualifier: Group I] [Condition: PAH], defined as a [Measurement: mPAP][Value: =25mmHg], [Measurement: PCWP][Value: <15mmHg] and [Measurement: PVR][The PVR =[Measurement: (mPAP-PCWP)/CO]][Value: >3.0 Woods unit].